Clinical trial exclusion criterion:
active herpes outbreak

Entity relations:
- Has_qualifier("herpes", "active")